Significant valvular heart disease, congenital heart disease, pulmonary heart disease or perinatal heart disease.

The above is a clinical trial exclusion criterion. Annotated with entity spans:
[Qualifier: Significant] [Condition: valvular heart disease], [Condition: congenital heart disease], [Condition: pulmonary heart disease] or [Condition: perinatal heart disease].